Clinical trial inclusion criterion:
Complex kidney stone (staghorn calculi GUYS III and IV)

Annotated entities:
- Condition: "Complex kidney stone"
- Condition: "staghorn calculi"
- Measurement: "GUYS"
- Value: "III and IV"